下列何者通行於肱二頭肌（biceps brachii）與肱肌（brachialis）之間？
A. 橈神經（Radial nerve）
B. 肌皮神經（Musculocutaneous nerve）
C. 尺神經（Ulnar nerve）
D. 正中神經（Median nerve）

正確答案：B. 肌皮神經（Musculocutaneous nerve）